下列有關輸尿管腎盂接合處阻塞（ureteropelvic junction obstruction）的敘述，何者錯誤？
A. 左側較常見
B. 其原因可能是接合處肌肉發育異常或異位血管（aberrant vessel）壓迫
C. 可併存於嚴重的膀胱輸尿管逆流（vesicoureteral reflux）
D. 超音波檢查可確定診斷及決定預後

正確答案：D. 超音波檢查可確定診斷及決定預後